Clinical trial inclusion criteria:
Be scheduled for trans-jugular liver biopsy the day of the ultrasound procedure.
Be at least 21 years of age.
Be medically stable.
If a female of child-bearing potential, must have a negative pregnancy test.
Be conscious and able to comply with study procedures.
Have read and signed the IRB-approved Informed Consent form for participating in the study.

Annotated entities:
- Procedure: "trans-jugular liver biopsy"
- Temporal: "the day of the ultrasound procedure"
- Reference_point: "ultrasound procedure"
- Procedure: "ultrasound procedure"
- Value: "at least 21 years"
- Person: "age"
- Condition: "medically stable"
- Person: "female"
- Condition: "child-bearing potential"
- Condition: "negative"
- Measurement: "pregnancy test"
- Non-query-able: "Be conscious and able to comply with study procedures."
- Post-eligibility: "Have read and signed the IRB-approved Informed Consent form for participating in the study."